Clinical trial exclusion criteria:
<18 years old
Evidence of decompensated liver disease
HOMA IR< 2.0
HIV seropositivity
Chronic HBV/HIV infection
Use of immune suppressing medications
Active malignancy

Annotated entities:
- Person: "old"
- Value: "<18 years"
- Qualifier: "decompensated"
- Condition: "liver disease"
- Measurement: "HOMA IR"
- Value: "< 2.0"
- Measurement: "HIV"
- Value: "seropositivity"
- Condition: "infection Chronic HBV"
- Condition: "HIV infection Chronic"
- Drug: "immune suppressing medications"
- Condition: "malignancy"
- Qualifier: "Active"